Type 2 Diabetes Mellitus patients

The above is a clinical trial inclusion criterion. Annotated with entity spans:
[Condition: Type 2 Diabetes Mellitus] patients